Adequate hematological, hepatic, and renal function

The above is a clinical trial inclusion criterion. Annotated with entity spans:
[Qualifier: Adequate] [Measurement: hematological], [Measurement: hepatic], and [Measurement: renal function]